Where, in what US state, was there a measles outbreak in an Amish community

The measles outbreak started an Amish community in Ohio